Be capable and willing to provide written informed consent to participate in this study;

The above is a clinical trial inclusion criterion. Annotated with entity spans:
[Informed_consent: Be capable and willing to provide written informed consent to participate in this study];